Clinical trial exclusion criterion:
Subjects with poor-controlled arterial hypertension (systolic blood pressure> 140 mmHg and diastolic blood pressure > 90 mm Hg) despite standard medical management; Coronary heart disease greater than ClassII; II-level arrhythmia (including QT interval prolongation, for man = 450 ms, for woman = 470 ms) together with Class II cardiac dysfunction;

Entity relations:
- Has_qualifier("arterial hypertension", "poor-controlled")
- Has_value("systolic blood pressure", "> 140 mmHg")
- Has_value("diastolic blood pressure", "> 90 mm Hg")
- AND("arterial hypertension", "systolic blood pressure")
- Has_qualifier("Coronary heart disease", "greater than ClassII")
- Has_qualifier("arrhythmia", "II-level")
- Has_qualifier("cardiac dysfunction", "Class II")
- Subsumes("arrhythmia", "QT interval prolongation")
- AND("arterial hypertension", "diastolic blood pressure")
- OR("arterial hypertension", "Coronary heart disease", "arrhythmia")